Señale la respuesta correcta en relación a la lactancia materna:
1. Es importante que la madre desinfecte bien su pezón antes de iniciar cada toma.
2. La primera toma de lactancia materna no debe realizarse antes de las 6 horas de vida.
3. La lactancia materna precisa de un horario fijo y estricto: una toma cada 4 horas.
4. No debe darse lactancia materna después de los 12 meses de vida.
5. La OMS recomienda la lactancia materna exclusiva hasta los 6 meses de edad.

Respuesta correcta: 5. La OMS recomienda la lactancia materna exclusiva hasta los 6 meses de edad.